What are Drosophila's balancer chromosomes?

Balancer chromosomes are genetic reagents that are used in Drosophila melanogaster for stock maintenance and mutagenesis screens. This problem is of particular importance when the mutant allele has been maintained with a balancer chromosome.